Renal insufficiency with estimated creatinine clearance <30 ml/min/1.73m2

The above is a clinical trial exclusion criterion. Annotated with entity spans:
[Condition: Renal insufficiency] with [Measurement: estimated creatinine clearance] [Value: <30 ml/min/1.73m2]